Clinical trial inclusion criteria:
Healthy Volunteers:
Age of at least 18 years
Existence of a contraceptive method for women of child-bearing age
Person affiliated to social security or beneficiary of such a scheme
Signed consent form
Systemic sclerosis patients:
Systemic sclerosis meeting the EULAR criteria.
Presence of at least 2 ischemic digital cutaneous ulcerations on two different fingers, with digital ulcers classified as "active ulcers" according to the North American working group definition: epithelial denudation is clearly Visible at one place and the bed of de-epithelialized ulcer can be seen; Ulcerations distal to the proximal interphalangeal joint, not associated with calcinosis or bony relief.
Ulcers whose major axis measured with the electronic caliper is ≥ 2 mm
Age greater than or equal to 18 years
Existence of a contraceptive method for women of reproductive age
A person who is or is a beneficiary of social security
Informed and signed consent signed by the patient or his / her legal representative.

Annotated entities:
- Parsing_Error: "Healthy Volunteers:"
- Value: "at least 18 years"
- Person: "Age"
- Device: "contraceptive method"
- Person: "women"
- Value: "child-bearing"
- Person: "age"
- Non-query-able: "Person affiliated to social security or beneficiary of such a scheme"
- Non-query-able: "Signed consent form"
- Not_a_criteria: "Systemic sclerosis patients:"
- Condition: "Systemic sclerosis"
- Measurement: "EULAR criteria"
- Value: "meeting"
- Multiplier: "at least 2 on two different fingers"
- Condition: "ischemic digital cutaneous ulcerations"
- Condition: "digital ulcers"
- Qualifier: "active"
- Measurement: "North American working group definition"
- Qualifier: "epithelial denudation is clearly Visible at one place and the bed of de-epithelialized ulcer can be seen; Ulcerations distal to the proximal interphalangeal joint, not associated with calcinosis or bony relief"
- Condition: "Ulcers"
- Measurement: "major axis"
- Value: "≥ 2 mm"
- Qualifier: "measured with the electronic caliper"
- Person: "Age"
- Value: "greater than or equal to 18 years"
- Device: "contraceptive"
- Person: "women"
- Value: "reproductive"
- Person: "age"
- Non-query-able: "A person who is or is a beneficiary of social security"
- Non-query-able: "Informed and signed consent signed by the patient or his / her legal representative"